Any surgical or medical condition, which in the opinion of the investigator, may place the patient at higher risk from his/her participation in the study, or is likely to prevent the patient from complying with the requirements of the study or completing the study

The above is a clinical trial exclusion criterion. Annotated with entity spans:
Any [Condition: surgical] or [Condition: medical condition], which [Non-query-able: in the opinion of the investigator], may [Qualifier: place the patient at higher risk from his/her participation in the study], or is [Mood: likely to prevent the patient from] [Informed_consent: complying with the requirements of the study] or completing the study